Clinical trial exclusion criterion:
Known or suspected infections that are severe, life threatening or are not included in the ABSSSI Food and Drug Administration (FDA) guidance

Annotated entities:
- Condition: "infections"
- Qualifier: "severe"
- Qualifier: "life threatening"